有關帕金森氏病（Parkinson's disease）病人在復健治療的原則上，下列敘述何者錯誤？
A. 病人因動作緩慢與協調失常，在復健上建議使用走路機（treadmill）作跑步訓練
B. 病人有明顯動作緩慢與協調失常時，使用帶輪子助行器（rolling walker）可協助維持其活動功能
C. 病人接受阻力運動（resistance exercise）與柔軟運動（flexibility exercise）治療可改善體能
D. 病人接受復健治療時，常需要視聽與觸感等各種感覺的提示（cues）

正確答案：A. 病人因動作緩慢與協調失常，在復健上建議使用走路機（treadmill）作跑步訓練